有一接受頸部廓清手術（neck dissection）之病人，回病房後發現有呼吸不適現象，被疑為膈神經受損。如何做有效而快速的診斷？
A. 做肺功能檢查
B. 做肺部超音波檢查
C. 做肺部電腦斷層檢查
D. 站立照 chest PA X 光片

正確答案：D. 站立照 chest PA X 光片